Hypersensibility to ingredients of intervention

The above is a clinical trial exclusion criterion. Annotated with entity spans:
[Condition: Hypersensibility] to [Drug: ingredients of intervention]